Diabetes mellitus or plasma glucose >11,1 at admission.

The above is a clinical trial exclusion criterion. Annotated with entity spans:
[Condition: Diabetes mellitus] or [Measurement: plasma glucose] [Value: >11,1] [Temporal: at admission].